Clinical trial inclusion criterion:
Presents to the Emergency Department (ED) and meets the clinical definition for Acute Bacterial Skin and Skin Structure Infections (ABSSSI)

Annotated entities:
- Visit: "Emergency Department (ED)"
- Measurement: "Acute Bacterial Skin and Skin Structure Infections"
- Measurement: "ABSSSI"